En relación con la función de partición molecular, se puede afirmar que:
1. Es una magnitud fundamental en Cinética Formal.
2. Permite calcular la fracción de moléculas de una sustancia que ocupan un determinado nivel energético.
3. Se puede calcular como suma de las funciones de participación traslacional, rotacional, vibracional y electrónica.
4. Contiene toda la información necesaria para calcular las propiedades químico-cuánticas de una molécula.

Respuesta correcta: 2. Permite calcular la fracción de moléculas de una sustancia que ocupan un determinado nivel energético.